Thiazolidinediones類降血糖藥物的主要作用機轉為何？
A. 降低胰島素抗性（insulin resistance）的產生
B. 促進胰島素的分泌作用
C. 抑制胰島素被肝臟代謝分解作用
D. 抑制peroxisome proliferator-activated receptor-gamma（PPAR-γ）受體的活性

正確答案：A. 降低胰島素抗性（insulin resistance）的產生